En la reparación del DNA por escisión de base:
1. Se eliminan entre 10 y 15 nucleótidos.
2. No se requiere una endonucleasa.
3. Se reparan únicamente bases que han sido desaminadas.
4. Se utilizan enzimas denominados DNA glucosilasas.

Respuesta correcta: 4. Se utilizan enzimas denominados DNA glucosilasas.